35-75 years old;

The above is a clinical trial inclusion criterion. Annotated with entity spans:
[Value: 35-75 years old];